Participants who can undergo contraception in case of being in childbearing period

The above is a clinical trial inclusion criterion. Annotated with entity spans:
[Pregnancy_considerations: Participants who can undergo contraception in case of being in childbearing period]